Systemic sclerosis patients:

The above is a clinical trial inclusion criterion. Annotated with entity spans:
[Not_a_criteria: Systemic sclerosis patients:]